All patients subjected to deep sedation in ambulant care, having a colonoscopy

The above is a clinical trial inclusion criterion. Annotated with entity spans:
All patients subjected to [Procedure: deep sedation] in [Visit: ambulant] care, having a [Procedure: colonoscopy]